Which medication are included in the Polycap polypill?

Polycap polypil contains aspirin, 100 mg; atenolol, 50 mg; ramipril, 5 mg; thiazide, 12.5 mg; and simvastatin, 20 mg. It is taken as two capsules once daily.